Clinical trial exclusion criterion:
Anaphylactic reaction to neomycin

Annotated entities:
- Condition: "Anaphylactic reaction"
- Drug: "neomycin"